臨床醫師目前無法使用下列那一項方式來治療過敏性氣喘？
A. 抗IgE 抗體（anti-IgE antibodies）
B. 類固醇（corticosteroid）
C. 減敏療法（desensitization immunotherapy）
D. 注射IL-12提升TH1細胞活性

正確答案：D. 注射IL-12提升TH1細胞活性